80 歲老翁有左心室擴大，時常發作心絞痛，心導管檢查並無嚴重冠狀動脈狹窄，二尖瓣正常，但有明顯主動脈瓣狹窄，此人最可能的主動脈瓣膜病變是：
A. calcific aortic stenosis
B. rheumatic aortic stenosis
C. syphilitic aortitis
D. Marfan syndrome

正確答案：A. calcific aortic stenosis